28 歲男性，無過去病史，因右小腿骨折，接受內固定手術。麻醉以腰椎硬脊膜外阻斷術施行。麻醉 前血壓為 120/80 mmHg，心跳每分鐘 70 下；在推完 17 mL 含有 1：200,000 epinephrine 的 2% lidocaine 溶液三分鐘後，病患主訴頭暈、嘴麻、耳鳴，此時血壓為 140/92 mmHg，心跳每分鐘 110 下，接著病患發生全身抽筋。請問此時的診斷最可能是什麼？
A. 癲癇發作（epilepsy attack）
B. 中風（stroke）
C. 意外 lidocaine 靜脈注射（inadvertent lidocaine intravascular injection）
D. 電解質不平衡（electrolytes imbalance）

正確答案：C. 意外 lidocaine 靜脈注射（inadvertent lidocaine intravascular injection）